Clinical trial inclusion criterion:
No concomitant anti-cancer treatment is allowed

Annotated entities:
- Context_Error: "No concomitant anti-cancer treatment is allowed"
- Post-eligibility: "No concomitant anti-cancer treatment is allowed"